Severe disease with a life expectancy of less than 3 months;

The above is a clinical trial exclusion criterion. Annotated with entity spans:
[Qualifier: Severe] [Condition: disease] with a [Observation: life expectancy] of [Value: less than 3 months];